Clinical trial exclusion criterion:
Investigational product use in the last 6 months

Annotated entities:
- Procedure: "Investigational product use"
- Temporal: "in the last 6 months"